下列何項因素不會使動脈血中二氧化碳（arterial carbon dioxide）分壓與吐氣末端二氧化碳（end-tidal carbon dioxide）分壓的梯度差異（gradient difference）增加？
A. fresh gas flow rates由4 L/min增加至8 L/min
B. air embolism
C. ventilation/perfusion mismatched
D. cardiac output由4 L/min增加至8 L/min

正確答案：D. cardiac output由4 L/min增加至8 L/min